Subject who the investigator deems inappropriate to participate in this study

The above is a clinical trial exclusion criterion. Annotated with entity spans:
[Non-query-able: Subject who the investigator deems inappropriate to participate in this study]